Clinical trial inclusion criterion:
Current height less than 5th percentile AND/OR

Entity relations:
- Has_value("height", "less than 5th percentile")
- Has_temporal("height", "Current")